Clinical trial inclusion criterion:
Abnormal nasal potential difference (NPD) as measured by a change in NPD in response to a low chloride solution and isoproterenol of less than -5 mV.

Annotated entities:
- Measurement: "nasal potential difference"
- Measurement: "NPD"
- Value: "Abnormal"
- Value: "less than -5 mV"
- Non-query-able: "as measured by a change in NPD in response to a low chloride solution and isoproterenol of"